Clinical trial exclusion criterion:
Impaired renal function (Serum creatinine >1.5 mg/dL in male, >1.4 mg/dL in female )

Annotated entities:
- Condition: "Impaired renal function"
- Measurement: "Serum creatinine"
- Value: ">1.5 mg/dL"
- Person: "male"
- Person: "female"
- Value: ">1.4 mg/dL"